Clinical trial inclusion criterion:
Treatment with stable doses of selective serotonin reuptake inhibitor antidepressants(SSRIs) is appropriate if stable for 3 months prior to randomization. Other psychotropics(with the exclusion of antipsychotics), if stable for 3 months, may be allowed only with Steering Committee approval on a case by case basis.

Entity relations:
- AND("Treatment", "selective serotonin reuptake inhibitor antidepressants(SSRIs)")
- Has_qualifier("selective serotonin reuptake inhibitor antidepressants(SSRIs)", "stable doses")